El potencial de equilibrio para un ión permeante a través de una membrana se calcula mediante:
1. El equilibrio de Gibbs-Donnan.
2. La ecuación de Goldman-Hodgkin-Katz.
3. La ecuación de Ohm.
4. La ecuación de Nernst.

Respuesta correcta: 4. La ecuación de Nernst.